有關嚴重二尖瓣膜逆流（severe mitral regurgitation）之敘述，下列何者錯誤？
A. 在急性嚴重二尖瓣膜逆流併心臟衰竭時，應考慮提早接受手術治療
B. 在有症狀之慢性原發性嚴重二尖瓣膜逆流（primary mitral regurgitation）之病患，藥物治療只能改善症狀，
C. 慢性原發性嚴重二尖瓣膜逆流（primary mitral regurgitation）之外科治療，以長期預後而言，瓣膜置換優於
D. 對於功能性嚴重二尖瓣膜逆流（functional mitral regurgitation），因屬於左心室功能問題，即使接受外科瓣膜手術後，其預後仍然比原發性二尖瓣膜逆流手術後結果差

正確答案：C. 慢性原發性嚴重二尖瓣膜逆流（primary mitral regurgitation）之外科治療，以長期預後而言，瓣膜置換優於